Allergic to contrast substance or radioisotope drugs used in procedures to assess endpoints of the study, which according to researchers, may be a contraindication to the implementation of these research methods.

The above is a clinical trial exclusion criterion. Annotated with entity spans:
[Condition: Allergic] to [Drug: contrast substance] or [Drug: radioisotope drugs] used in procedures to assess endpoints of the study, which according to researchers, may be a contraindication to the implementation of these research methods.